Clinical trial inclusion criterion:
Decline physical function (walking speed < 1 m/s) Group 3 (Either or both)

Entity relations:
- Has_value("walking speed", "< 1 m/s")
- Subsumes("Decline physical function", "walking speed")